Clinical trial exclusion criterion:
Diabetes or immediate family history of diabetes

Entity relations:
- Has_context("diabetes", "immediate family history")
- OR("Diabetes", "diabetes")